Clinical trial exclusion criterion:
Familial hypercholesterolemia;

Annotated entities:
- Condition: "Familial hypercholesterolemia"